El Test de Apercepción Temática (TAT) de Murray es una técnica de evaluación:
1. Objetiva.
2. Subjetiva y de juego.
3. Proyectiva.
4. Experimental.

Respuesta correcta: 3. Proyectiva.